Systemic corticosteroids (oral or injectable) within 7 days of first dose of 852A (topical or inhaled steroids are allowed)

The above is a clinical trial exclusion criterion. Annotated with entity spans:
[Drug: Systemic corticosteroids] ([Qualifier: oral] or [Qualifier: injectable]) [Temporal: within 7 days of first dose] of [Drug: 852A] ([Drug: topical] or [Drug: inhaled steroids] [Negation: are allowed])